Clinical trial exclusion criterion:
Subject is considered to be a part of a vulnerable population (eg. prisoners or those without sufficient mental capacity).

Annotated entities:
- Person: "part of a vulnerable population"
- Person: "prisoners"
- Condition: "without sufficient mental capacity"